有一位9個月大的兒童，由她的祖母帶到健兒門診，接受全民健康保險兒童預防保健服務的第4次檢查，除了檢查身高、體重、頭圍、營養狀態及一般檢查等身體檢查外，這兒童還需要進行那項發展診查？
A. 是否可以「手指拿物」
B. 是否可以「對人微笑」
C. 是否可以「發ㄅㄚ、ㄇㄚ音」
D. 是否可以「扶走」

正確答案：C. 是否可以「發ㄅㄚ、ㄇㄚ音」